有關上鞏膜炎（episcleritis），下列敘述何者錯誤？
A. 好發於 20 至 50 歲病人
B. 使用 10% phenylephrine 點眼，不會讓充血的上鞏膜血管變白，因此可與鞏膜炎（scleritis）作鑑別
C. 與鞏膜炎比較，屬於較良性，且大部分可自動緩解
D. 可能會復發

正確答案：B. 使用 10% phenylephrine 點眼，不會讓充血的上鞏膜血管變白，因此可與鞏膜炎（scleritis）作鑑別